下列何者之分支不供應陰囊（scrotum）？
A. 提睪肌動脈（cremasteric artery）
B. 股動脈（femoral artery）
C. 陰莖球動脈（artery of the bulb of penis）
D. 髂內動脈（internal iliac artery）

正確答案：C. 陰莖球動脈（artery of the bulb of penis）